Clinical trial inclusion criterion:
Patients with chronic thromboembolic pulmonary hypertension (CTEPH)

Annotated entities:
- Condition: "chronic thromboembolic pulmonary hypertension (CTEPH)"